Clinical trial exclusion criterion:
are under 19 years old

Entity relations:
- Has_value("old", "under 19 years")